¿Qué compuestos resultan de la reacción del estaño con los halógenos?
1. Se obtienen los trihaluros SnX3.
2. Los únicos productos que se obtienen son los dihaluros SnX2, que son los únicos haluros conocidos.
3. No reacciona con los halógenos.
4. Dan fácilmente los tetrahaluros SnX4. Por ejemplo, el estaño reacciona con cloro en frio para dar el tetracloruro de estaño.

Respuesta correcta: 4. Dan fácilmente los tetrahaluros SnX4. Por ejemplo, el estaño reacciona con cloro en frio para dar el tetracloruro de estaño.